Clinical trial inclusion criterion:
4. All subjects should be judged normal and healthy during a pre-study medical evaluation (physical examination, laboratory evaluation, 12-lead ECG, hepatitis B and hepatitis C tests, HIV test, and urine drug screen including amphetamine, barbiturates, benzodiazepine, cannabinoid, cocaine, opiates, phencyclidine, and methadone) performed within 14 days of the initial dose of study medication.

Entity relations:
- AND("pre-study medical evaluation", "normal")
- Has_qualifier("urine drug screen", "amphetamine")
- Has_index("within 14 days of the initial dose of study medication", "the initial dose of study medication")
- Subsumes("pre-study medical evaluation", "physical examination")
- Has_temporal("pre-study medical evaluation", "within 14 days of the initial dose of study medication")
- AND("pre-study medical evaluation", "healthy")
- Has_qualifier("urine drug screen", "barbiturates")
- Has_qualifier("urine drug screen", "benzodiazepine")
- Has_qualifier("urine drug screen", "cannabinoid")
- Has_qualifier("urine drug screen", "cocaine")
- Has_qualifier("urine drug screen", "opiates")
- Has_qualifier("urine drug screen", "phencyclidine")
- Has_qualifier("urine drug screen", "methadone")
- Subsumes("pre-study medical evaluation", "laboratory evaluation")
- Subsumes("pre-study medical evaluation", "12-lead ECG")
- Subsumes("pre-study medical evaluation", "hepatitis B tests")
- Subsumes("pre-study medical evaluation", "hepatitis C tests")
- Subsumes("pre-study medical evaluation", "HIV test")
- Subsumes("pre-study medical evaluation", "urine drug screen")